Spondylolisthesis

The above is a clinical trial inclusion criterion. Annotated with entity spans:
[Condition: Spondylolisthesis]